關於精索（spermatic cord）的組成構造，下列敘述何者正確？
A. 輸精管（ductus deferens）具有三層平滑肌
B. 蔓狀叢（pampiniform plexus）為典型的中型靜脈（typical medium-sized vein）
C. 輸精管（ductus deferens）的上皮屬於單層柱狀上皮（simple columnar epithelium）
D. 主要由豐富的網狀纖維（reticular fiber）填充其中

正確答案：A. 輸精管（ductus deferens）具有三層平滑肌